Clinical trial exclusion criterion:
Oral contraceptive

Annotated entities:
- Drug: "Oral contraceptive"